王先生因為腹膜炎接受手術，術中發現空腸、迴腸及右側結腸呈現缺血壞死現象，下列何者是最可能的診斷？
A. superior mesenteric artery thrombosis
B. inferior mesenteric artery embolism
C. superior mesenteric vein thrombosis
D. non-occlusive mesentery ischemia

正確答案：A. superior mesenteric artery thrombosis